Which chromosome contains the TLR7 locus in the human genome?

The Toll-like receptor 7 (TLR7) gene, encoded on human chromosome Xp22.3, is crucial for type I interferon production . The major candidate gene for causation of the Yaa-associated autoimmune phenotypes has been TLR7 . The Toll like receptor 7 gene is encoded by a gene on the X chromosome gene, denoted TLR 7 in humans and Tlr7 in the mouse, and expressed in plasmacytoid dendritic cells .